El centro activo de una enzima:
1. Está formado por grupos funcionales que provienen de la secuencia de aminoácidos central de la enzima.
2. Constituye una gran parte del volumen total de la enzima.
3. Aumenta la ∆G de una reacción, aumentando la velocidad de la misma.
4. Presenta junto a los aminoácidos una elevada cantidad de moléculas de agua.
5. Es la región que se une a los sustratos y contiene los residuos que participan en la formación y ruptura de enlaces.

Respuesta correcta: 5. Es la región que se une a los sustratos y contiene los residuos que participan en la formación y ruptura de enlaces.